下列何種金屬過量暴露吸收，會造成人體出現振顫（tremor）和動作不協調（ataxia）等水俣病症狀？
A. 汞
B. 鉈
C. 鎘
D. 鋁

正確答案：A. 汞